Clinical trial inclusion criterion:
Patient's weight and height and abdominal circumference

Annotated entities:
- Procedure: "abdominal circumference"
- Procedure: "height"
- Procedure: "weight"